7. A serious underlying medical condition that would impair the ability of the patient to receive protocol treatment.

The above is a clinical trial exclusion criterion. Annotated with entity spans:
7. [Post-eligibility: A serious underlying medical condition that would impair the ability of the patient to receive protocol treatment.]